El trastorno en el que, tras la muerte de una persona significativa, el sufrimiento que acompaña al luto no sigue las expectativas normales y se manifiesta en un deterioro funcional con síntomas que persisten mucho después de la muerte, se denomina:
1. Duelo ineficaz.
2. Duelo alterado.
3. Duelo disfuncional.
4. Duelo complicado.

Respuesta correcta: 4. Duelo complicado.